Clinical trial exclusion criterion:
Patients with important organ dysfunctions.

Entity relations:
- Has_qualifier("organ dysfunctions", "important")